Clinical trial inclusion criterion:
A primary complaint of pain in the area between the 12th rib and buttock crease without leg pain

Annotated entities:
- Condition: "pain"
- Qualifier: "area between the 12th rib and buttock crease"
- Condition: "leg pain"
- Negation: "without"